High suicide risk, i.e. intent or plan to attempt suicide in near future;

The above is a clinical trial exclusion criterion. Annotated with entity spans:
[Qualifier: High] [Observation: suicide risk], i.e. [Mood: intent] or [Mood: plan to] [Observation: attempt suicide] [Temporal: in near future];